Clinical trial exclusion criterion:
PN in the last 7 days prior to study enrollment.

Entity relations:
- Has_index("in the last 7 days prior to study enrollment", "study enrollment")
- Has_temporal("PN", "in the last 7 days prior to study enrollment")